我國法	規定所稱之「日時	平均容許	濃	」係指工作多少小時之平均容許	濃	？
A. 最高15分鐘
B. 每日4小時
C. 每日8小時
D. 每週40小時

正確答案：C. 每日8小時